Clinical trial inclusion criterion:
age greater than 18 years old

Annotated entities:
- Person: "age"
- Value: "greater than 18 years old"